Type 2 myocardial infarction

The above is a clinical trial exclusion criterion. Annotated with entity spans:
[Condition: Type 2 myocardial infarction]